Clinical trial exclusion criterion:
American Association of Anesthesiology class 1-3

Entity relations:
- Has_value("American Association of Anesthesiology class", "1-3")